Clinical trial exclusion criterion:
Aortic regurgitation mild or greater

Annotated entities:
- Condition: "Aortic regurgitation"
- Qualifier: "mild or greater"